Clinical trial exclusion criterion:
Patients with a seizure history

Annotated entities:
- Condition: "seizure"
- Temporal: "history"